(i) influenza vaccination, which may be received at least 2 weeks before study vaccines.

The above is a clinical trial exclusion criterion. Annotated with entity spans:
(i) [Drug: influenza vaccination], which may be received [Temporal: at least 2 weeks before study vaccines].